Clinical trial exclusion criterion:
Patients with NOAC preference apart from preference consistent with current cluster randomized NOAC.

Annotated entities:
- Drug: "NOAC"
- Observation: "NOAC preference"
- Non-representable: "apart from preference consistent with current cluster randomized NOAC."